Clinical trial inclusion criterion:
Acute kidney injury, defined as increase in S-creatinine 50% or 27 mol/L

Annotated entities:
- Condition: "Acute kidney injury"
- Measurement: "increase in S-creatinine"
- Value: "50% or 27 mol/L"